Patients receiving psychotropics of any kind, including betablockers and other anticonvulsants. Sleep medication such as oral chloral-hydrate or zopiclone are acceptable.

The above is a clinical trial exclusion criterion. Annotated with entity spans:
Patients receiving [Drug: psychotropics] of any kind, including [Drug: betablockers] and other [Drug: anticonvulsants]. [Drug: Sleep medication] such as [Qualifier: oral] [Drug: chloral-hydrate] or [Drug: zopiclone] are [Negation: acceptable].